社會流行病學的研究取向，不具下述那一項特點？
A. 個人行為的社會性分析（social characteristics）
B. 高風險個體預防策略（high-risk preventive strategy）
C. 群體預防策略（population preventive strategy）
D. 關心疾病的遠因（distal causes）或根本原因（root causes）

正確答案：B. 高風險個體預防策略（high-risk preventive strategy）